BMI >18 and <35 kg/m2

The above is a clinical trial inclusion criterion. Annotated with entity spans:
[Measurement: BMI] [Value: >18 and <35 kg/m2]